下列何者是心臟復健的高危險因子？
A. 鬱血性心衰竭的病患服藥控制病情穩定
B. 運動時收縮壓上升 20 mmHg
C. 左心室收縮射出率（ejection fraction）＞50%
D. 最近發生心室心搏過速（ventricular tachycardia）

正確答案：D. 最近發生心室心搏過速（ventricular tachycardia）